Clinical trial inclusion criterion:
No contraindications to general and regional anesthesia

Annotated entities:
- Condition: "contraindications"
- Procedure: "regional anesthesia"
- Procedure: "general anesthesia"
- Negation: "No"